Clinical trial exclusion criterion:
Patients who have had an operative procedure involving the eye, ear, or central nervous system within one month;

Annotated entities:
- Procedure: "operative procedure"
- Qualifier: "eye"
- Qualifier: "ear"
- Qualifier: "central nervous system"
- Temporal: "within one month"